下列對引起慢性阻塞性肺病（COPD）之機轉的敘述，何者為錯？
A. 抽菸為重要危險因子之一
B. 控制α1-antitrypsin 之基因變異，也會引起早期產生之 COPD
C. COPD 是以嗜酸性白血球（eosinophil）為主的慢性炎症反應
D. 因 protease inhibitor 失調

正確答案：C. COPD 是以嗜酸性白血球（eosinophil）為主的慢性炎症反應